Have a documented diagnosis of persistent asthma, as defined by the National Institutes of Health for at least 3 months prior to the Screening Visit.

The above is a clinical trial inclusion criterion. Annotated with entity spans:
Have a documented diagnosis of [Condition: persistent asthma], [Qualifier: as defined by the National Institutes of Health] for [Temporal: at least 3 months prior to the Screening Visit].